Clinical trial inclusion criterion:
Able to read and understand Norwegian.

Annotated entities:
- Observation: "Able to read and understand Norwegian"